En el análisis cuantitativo por cromatografía de gases, para minimizar las incertidumbres que se introducen con la inyección de la muestra, la velocidad de flujo y las variaciones en las condiciones de las columnas se emplea:
1. La estimación manual de las alturas de pico cromatográfico.
2. La normalización de las áreas.
3. El método de adiciones estándar.
4. Un calibrado externo.
5. El método del patrón interno.

Respuesta correcta: 5. El método del patrón interno.